Entre otras propiedades con respecto a la hipericina podemos indicar:
1. Es un potente hepatoprotector extraído de las raíces de Hypericum perforatum.
2. Es un potente colagogo que se extrae de la resina del rizoma de Hypericum perforatum.
3. Es un antivirretroviral extraíble de las partes aéreas de Hypericum perforatum.
4. Es un laxante que se extrae de las hojas de Hypericum perforatum.
5. Es un potente hepatoprotector presente en los frutos de Hypericum perforatum.

Respuesta correcta: 3. Es un antivirretroviral extraíble de las partes aéreas de Hypericum perforatum.